• Arthritis (physician-diagnosed)

The above is a clinical trial inclusion criterion. Annotated with entity spans:
• [Condition: Arthritis] (physician-diagnosed)